Receiving nasal or facial surgery recently;

The above is a clinical trial exclusion criterion. Annotated with entity spans:
Receiving [Procedure: nasal] or [Procedure: facial surgery] recently;